Las cápsulas gastrorresistentes o entéricas se emplean en los siguientes casos EXCEPTO uno de ellos:
1. Cuando el principio activo se inactiva por la presencia de jugo gástrico.
2. Cuando es un principio activo emético.
3. Cuando es un principio activo gastrolesivo.
4. Cuando se desea evitar alergias a colorantes.

Respuesta correcta: 4. Cuando se desea evitar alergias a colorantes.